Clinical trial exclusion criterion:
Diagnosed with secondary hypertension or suspected of secondary hypertension [e.g., renovascular disease, adrenal medullary and cortical hyperfunction, coarctation of the aorta, hyperaldosteronism, unilateral or bilateral renal artery stenosis, Cushing's syndrome, pheochromocytoma, polycystic kidney disease, etc.]

Entity relations:
- Has_qualifier("hypertension", "secondary")
- Has_qualifier("hypertension", "secondary")
- Has_mood("hypertension", "suspected")
- Has_qualifier("renal artery stenosis", "unilateral")
- Subsumes("hypertension", "renovascular disease")
- OR("unilateral", "bilateral")
- OR("renovascular disease", "cortical hyperfunction", "polycystic kidney disease", "pheochromocytoma", "Cushing's syndrome", "renal artery stenosis", "hyperaldosteronism", "coarctation of the aorta", "adrenal medullary hyperfunction")
- OR("hypertension", "hypertension")